What is the effect of notch in the division of neural progenitor cells in Drosophila?

Notch signaling is an evolutionarily conserved mechanism, used to regulate cell fate decisions. Disruption of Notch signaling causes neuronal progenitor cell self-renewal, a hallmark of systemic lupus erythematosus (SLE), and leads to premature differentiation of them into the erythroid lineage.